Clinical trial exclusion criterion:
Historical or current evidence of clinically significant or rapidly progressing or unstable cardiovascular, neurological, cardiovascular, neurological, renal, hepatic, immunological, endocrine (including uncontrolled diabetes or thyroid disease) or hematological abnormalities that are uncontrolled. Significant is defined as any disease that, in the opinion of the investigator, would put the safety of the subject at risk through participation, or which would affect the analysis if the disease/condition exacerbated during the study.

Entity relations:
- Has_qualifier("diabetes", "uncontrolled")
- Subsumes("endocrine abnormalities", "diabetes")
- Has_qualifier("cardiovascular abnormalities", "clinically significant")
- Has_qualifier("cardiovascular abnormalities", "uncontrolled")
- Has_context("cardiovascular abnormalities", "Historical")
- OR("clinically significant", "rapidly progressing", "unstable")
- OR("diabetes", "thyroid disease")
- OR("cardiovascular abnormalities", "neurological abnormalities", "cardiovascular abnormalities", "neurological abnormalities", "renal abnormalities", "hepatic abnormalities", "immunological abnormalities", "endocrine abnormalities", "hematological abnormalities")
- OR("Historical", "current")